Clinical trial exclusion criterion:
Medullary thyroid carcinoma (MTC) or Multiple Endocrine Neoplasia Syndrome Type 2 (MEN 2)

Entity relations:
- Subsumes("Multiple Endocrine Neoplasia Syndrome Type 2", "MEN 2")
- Subsumes("Medullary thyroid carcinoma", "MTC")
- OR("Medullary thyroid carcinoma", "Multiple Endocrine Neoplasia Syndrome Type 2")